use of basal-bolus insulin

The above is a clinical trial inclusion criterion. Annotated with entity spans:
use of [Drug: basal-bolus insulin]